Un componente característico de la mureína o peptidoglicano de la mayoría de las bacterianas es:
1. El ácido dipicolínico.
2. El ácido L-glutámico.
3. La D-alanina.
4. La manosamina.
5. La diaminoglucosa.

Respuesta correcta: 3. La D-alanina.